Clinical trial exclusion criterion:
Subjects who have human Immunodeficiency virus (HIV), hepatitis B virus (HBV), and hepatitis C virus (HCV)

Annotated entities:
- Condition: "human Immunodeficiency virus (HIV)"
- Condition: "hepatitis B virus (HBV)"
- Condition: "hepatitis C virus (HCV)"
- Grammar_Error: "and"